medical history that contraindicates the use of epinephrine

The above is a clinical trial exclusion criterion. Annotated with entity spans:
[Temporal: medical history] that [Condition: contraindicates] the use of [Drug: epinephrine]